Suspicion of secondary ITP

The above is a clinical trial exclusion criterion. Annotated with entity spans:
Suspicion of [Condition: secondary ITP]